Clinical trial inclusion criterion:
total bilirubin ≤ 1.5 x ULN (patients with Gilbert's syndrome total bilirubin ≤2.5 x ULN)

Annotated entities:
- Measurement: "total bilirubin"
- Value: "≤ 1.5 x ULN"
- Condition: "Gilbert's syndrome"
- Measurement: "total bilirubin"
- Value: "≤2.5 x ULN"